Clinical trial inclusion criterion:
The selection of the subjects will be at the discretion of the individual investigator

Annotated entities:
- Non-representable: "The selection of the subjects will be at the discretion of the individual investigator"